下列有關蛛網膜下腔（subarachnoid space）的敘述，何者錯誤？
A. 分泌腦脊髓液（CSF）
B. 會沿著視神經（optic nerve）延伸到眼球後壁
C. 與大腦腦室相通
D. 內有大腦動脈

正確答案：A. 分泌腦脊髓液（CSF）